一早產兒發生腹脹、活動力變差，腹部 X 光檢查呈現 pneumatosis intestinalis，有關後續處置，下列何者錯誤？
A. 應禁食，並放胃管減壓
B. 應給予廣效抗生素
C. 矯正酸中毒及腹部 X 光追蹤
D. 一旦情況穩定，為避免腸壞死，應立刻開刀

正確答案：D. 一旦情況穩定，為避免腸壞死，應立刻開刀